下列對於「心房利鈉尿肽（atrial natriuretic peptide）」之敘述，何者正確？
A. 主要由心室之心肌細胞負責分泌
B. 主要由內皮細胞負責分泌
C. 主要功能為增加血壓
D. 主要功能為調節電解質及降低血壓

正確答案：D. 主要功能為調節電解質及降低血壓